Which algorithm has been developed for finding conserved non-coding elements (CNEs)?

CNEFinder is a tool for identifying CNEs between two given DNA sequences with user-defined criteria.